pregnancy and breast feeding mothers

The above is a clinical trial exclusion criterion. Annotated with entity spans:
[Condition: pregnancy] and [Observation: breast feeding] mothers